Patients with other factors causing liver diseases.

The above is a clinical trial exclusion criterion. Annotated with entity spans:
[Non-representable: Patients with other factors causing liver diseases].